下列有關前臂骨折包紮石膏治療時的敘述，何者正確？
A. 包紮時用拇指持續壓迫骨折處以維持復位
B. 肘部應固定呈伸直姿勢
C. 為加強固定效果，應包紮大拇指和手指，限制其活動
D. 包紮後維持手部抬高，並定期拍照 X 光片追蹤

正確答案：D. 包紮後維持手部抬高，並定期拍照 X 光片追蹤